肩胛骨內緣背翻，無法貼近胸壁，此現象最可能肇因於下列何者之損傷？
A. 前鋸肌（serratus anterior）
B. 斜方肌（trapezius）
C. 大菱形肌（rhomboid major）
D. 肩胛提肌（levator scapulae）

正確答案：A. 前鋸肌（serratus anterior）